Clinical trial exclusion criterion:
Therapy area located outside of head and neck;

Annotated entities:
- Non-representable: "Therapy area located outside of head and neck;"